Subject must meet all required subject suitability criteria that pertain to normal source plasma donors.

The above is a clinical trial inclusion criterion. Annotated with entity spans:
[Undefined_semantics: Subject must meet all required subject suitability criteria that pertain to normal source plasma donors.]